Describe the role of bevacizumab in radiosurgery for arteriovenous malformation.

Bevacizumab is used for the treatment of severe, refractory perilesional edema due to an arteriovenous malformation treated with stereotactic radiosurgery.